職業引起的帕金森氏症（Parkinsonism）與以下何種物質之暴露最有關？
A. 汞（Mercury）
B. 錳（Manganese）
C. 四氯化碳（Carbon tetrachloride）
D. 有機磷劑（Organophosphate）

正確答案：B. 錳（Manganese）